Clinical trial exclusion criterion:
Significant illness, trauma or surgical procedures.

Entity relations:
- Has_qualifier("illness", "Significant")
- OR("illness", "surgical procedures", "trauma")